Clinical trial exclusion criterion:
Pain on hip or ankle

Annotated entities:
- Condition: "Pain"
- Qualifier: "hip"
- Qualifier: "ankle"